Clinically significant bronchiectasis

The above is a clinical trial exclusion criterion. Annotated with entity spans:
[Qualifier: Clinically significant] [Condition: bronchiectasis]